6-min walk of > 50m (without rehabilitation) or > 100m (with rehabilitation)

The above is a clinical trial inclusion criterion. Annotated with entity spans:
[Measurement: 6-min walk] of [Value: > 50m] ([Negation: without] [Qualifier: rehabilitation]) or [Value: > 100m] (with [Qualifier: rehabilitation])